What is Desomorphine?

Desomorphine is an opioid misused as "crocodile", a cheaper alternative to heroin Desomorphine is the semi-synthetic opioid claimed to be the main component of krokodil